下列何者構成坐骨肛門窩（ischioanal fossae）的外側壁？
A. 提肛肌
B. 梨狀肌
C. 尾骨肌
D. 閉孔內肌

正確答案：D. 閉孔內肌